有關空腸曲狀桿菌（Campylobacter jejuni）引起之腸胃炎的敘述，何者有誤？
A. 一般為水瀉，但也可能出現血便
B. 未治療者，有 20%會復發
C. 有些病人可能發生 Guillain-Barre 症候群
D. 傳染途徑與飲水無關

正確答案：D. 傳染途徑與飲水無關